Allergy/hypersensitivity to acetaminophen

The above is a clinical trial exclusion criterion. Annotated with entity spans:
[Condition: Allergy]/[Condition: hypersensitivity] to [Drug: acetaminophen]